在治療癌症時，與單株抗體連接的細胞毒殺物質稱為什麼？
A. adjuvant
B. immunotoxin
C. defensin
D. l cytokine

正確答案：B. immunotoxin